Clinical trial exclusion criterion:
previous pelvic surgeries

Entity relations:
- Has_temporal("pelvic surgeries", "previous")